Which proteins remove H2A.Z in the yeast Saccharomyces cerevisiae?

Budding yeast INO80 can remove H2A.Z/H2B dimers from chromatin and replace them with H2A/H2B dimers. Removal of H2A.Z by INO80 promotes homologous recombination H2A.Z removal from chromatin is the primary function of INO80 and ANP32E in promoting homologous recombination.